Clinical trial exclusion criterion:
Patient with Hepatitis B Virus (HBV), Hepatitis C Virus (HCV) and Human Immunodeficiency Virus (HIV) infections

Annotated entities:
- Condition: "Hepatitis B Virus infections"
- Condition: "Hepatitis C Virus infections"
- Condition: "HBV"
- Condition: "HCV"
- Condition: "Human Immunodeficiency Virus infections"
- Condition: "HIV"